What is the association between maternal and fetal alloantigens and RANTES production?

Induction of maternal tolerance to fetal alloantigens by RANTES production.